stroke within the preceding 12 months.

The above is a clinical trial exclusion criterion. Annotated with entity spans:
[Condition: stroke] [Temporal: within the preceding 12 months].